Clinical trial inclusion criteria:
generally healthy grade 1-2 school children
with written parental consent
with at least 1 sound and fully erupted permanent first molar

Annotated entities:
- Condition: "generally healthy"
- Observation: "grade 1-2 school"
- Person: "children"
- Informed_consent: "with written parental consent"
- Multiplier: "at least 1"
- Qualifier: "sound"
- Qualifier: "fully erupted"
- Condition: "permanent first molar"